Patients must be over 65 years old.

The above is a clinical trial inclusion criterion. Annotated with entity spans:
Patients must be [Value: over 65 years] [Person: old].